Clinical trial exclusion criterion:
Known hypersensitivity or allergy to n-acetylcysteine, or receiving chronic therapy with medication that could interact adversely with n-acetylcysteine within 30 days prior to randomization (i.e., nitroglycerin, ACE inhibitors or antihypertensive drugs, anti-coagulants);

Annotated entities:
- Condition: "hypersensitivity"
- Condition: "allergy"
- Drug: "n-acetylcysteine"
- Procedure: "chronic therapy"
- Drug: "n-acetylcysteine"
- Temporal: "within 30 days prior to randomization"
- Drug: "nitroglycerin"
- Drug: "ACE inhibitors"
- Drug: "antihypertensive drugs"
- Drug: "anti-coagulants"